Clinical trial exclusion criterion:
Known or suspected allergy to trial product(s) or related products

Entity relations:
- AND("allergy to trial product(s)", "trial product(s)")
- AND("allergy related products", "related products")
- OR("allergy to trial product(s)", "allergy related products")